Clinical trial exclusion criterion:
Patient have contraindication to chemotherapy(eg.uncontrolled coronarism and heart failure; History of myocardial infarction within the past 6 months, Chronic obstructive pulmonary, uncontrolled epileptic attack and other disease that investigator consider it unsuitable for the chemotherapy)

Entity relations:
- Has_qualifier("coronarism", "uncontrolled")
- AND("contraindication", "chemotherapy")
- Has_temporal("myocardial infarction", "within the past 6 months")
- Has_temporal("myocardial infarction", "History")
- AND("unsuitable for the chemotherapy", "chemotherapy")
- Has_qualifier("disease", "other")
- Has_qualifier("epileptic attack", "uncontrolled")
- AND("disease", "unsuitable for the chemotherapy")
- Subsumes("contraindication", "coronarism")
- OR("coronarism", "heart failure")
- OR("coronarism", "disease", "Chronic obstructive pulmonary", "myocardial infarction", "epileptic attack")